Clinical trial inclusion criterion:
General good health as established by medical history and physical examination

Entity relations:
- Has_qualifier("General good health", "established by medical history")
- AND("General good health", "physical examination")